Known severe renal insufficiency

The above is a clinical trial exclusion criterion. Annotated with entity spans:
Known [Qualifier: severe] [Condition: renal insufficiency]